Clinical trial exclusion criterion:
Patients with serious and unstable illnesses including current hepatic, renal, gastroenterologic, respiratory, cardiovascular (including ischemic heart disease and congestive heart failure), endocrinologic, neurologic (including stroke, transient ischemic attack, subarachnoidal bleeding, brain tumor, encephalopathy, and meningitis).

Annotated entities:
- Qualifier: "serious"
- Qualifier: "unstable"
- Condition: "hepatic"
- Condition: "renal"
- Condition: "gastroenterologic"
- Condition: "respiratory"
- Condition: "cardiovascular"
- Condition: "neurologic"
- Condition: "endocrinologic"
- Condition: "ischemic heart disease"
- Condition: "congestive heart failure"
- Condition: "stroke"
- Condition: "transient ischemic attack"
- Condition: "subarachnoidal bleeding"
- Condition: "brain tumor"
- Condition: "encephalopathy"
- Condition: "meningitis"